Clinical trial inclusion criterion:
Subject or legal representative has voluntarily signed the informed consent approved by the Institutional Review Board,

Annotated entities:
- Informed_consent: "Subject or legal representative has voluntarily signed the informed consent approved by the Institutional Review Board,"